Clinical trial exclusion criterion:
Women with active thromboembolic disorders

Annotated entities:
- Person: "Women"
- Qualifier: "active"
- Condition: "thromboembolic disorders"